Body mass index >85%ile for age and sex by standard growth charts;

The above is a clinical trial inclusion criterion. Annotated with entity spans:
[Measurement: Body mass index] [Value: >85%ile] for age and sex by standard growth charts;